use of medications that are inducers of CYP2A6 (a nicotine metabolizing enzyme) such as rifampicin, dexamethasone, phenobarbital, and other anti-convulsant drugs

The above is a clinical trial exclusion criterion. Annotated with entity spans:
use of [Drug: medications] that are [Qualifier: inducers of CYP2A6] (a [Drug: nicotine metabolizing enzyme]) such as [Drug: rifampicin], [Drug: dexamethasone], [Drug: phenobarbital], and other [Drug: anti-convulsant drugs]